Clinical trial exclusion criterion:
Vaccination less than 6 weeks prior to treatment with Lemtrada.

Annotated entities:
- Drug: "Vaccination"
- Temporal: "less than 6 weeks prior to treatment with Lemtrada"
- Reference_point: "treatment with Lemtrada"
- Procedure: "treatment"
- Drug: "Lemtrada"